假設 10 年前 25%的心肌梗塞病人在發病 24 小時內死亡，這個比例稱為個案致死率（case fatality），有位研究者想了解 10 年來心肌梗塞病人的個案致死率是否有顯著的改變，在他收集的 15 位新的心 肌梗塞病人，5 位 24 小時內死亡，此研究者應該使用何種統計方法來回答他的研究問題？
A. 單一樣本 z 檢定
B. 單一樣本 t 檢定
C. 單一樣本二項比例檢定
D. 兩個樣本二項比例檢定

正確答案：C. 單一樣本二項比例檢定